腕隧道症候群（Carpal tunnel syndrome）是何種神經之壓迫症狀？
A. 橈神經（radial nerve）
B. 尺神經（ulnar nerve）
C. 正中神經（median nerve）
D. 骨間神經（interosseous nerve）

正確答案：C. 正中神經（median nerve）